有關腰椎脊柱裂併脊髓膨出症（myelomeningocele）之敘述，下列何者最為完整？①是胚胎期神經管的缺陷，隨	年齡增長會有可能增加嚴重度 ②患者會出現感覺缺損 ③患者會出現運動功能缺損 ④患者會出現大小便功能缺損
A. 僅①②
B. 僅①③
C. 僅①②③
D. ①②③④

正確答案：D. ①②③④